Females must not be pregnant and must have a negative serum pregnancy test result at the Screening Visit and Day -1.

The above is a clinical trial inclusion criterion. Annotated with entity spans:
[Post-eligibility: Females must not be pregnant and must have a negative serum pregnancy test result at the Screening Visit and Day -1.]